Lack of consent

The above is a clinical trial exclusion criterion. Annotated with entity spans:
[Informed_consent: Lack of consent]